Clinical trial inclusion criterion:
resection must have been histologically complete in depth,

Annotated entities:
- Condition: "resection"
- Procedure: "histologically"
- Qualifier: "complete in depth"